Clinical trial inclusion criterion:
IFG: 5.6mmol/L (100mg/dl)=FPG<7.0mmol/L (126mg/dl), or IGT: 7.8mmol/L (140mg/dl)=OGTT 2-h PG<11.1mmol/L (200mg/dl), or HbA1C 5.7-6.4% (39-47mmol/mol);

Entity relations:
- Subsumes("5.6mmol/L", "100mg/dl")
- Subsumes("<7.0mmol/L", "126mg/dl")
- Has_value("FPG", "5.6mmol/L")
- Has_value("FPG", "<7.0mmol/L")
- Subsumes("5.7-6.4%", "39-47mmol/mol")
- Has_value("HbA1C", "5.7-6.4%")
- Subsumes("<11.1mmol/L", "200mg/dl")
- Subsumes("7.8mmol/L", "140mg/dl")
- Has_value("OGTT 2-h PG", "7.8mmol/L")
- Has_value("OGTT 2-h PG", "<11.1mmol/L")
- Subsumes("IFG", "FPG")
- Subsumes("IGT", "OGTT 2-h PG")
- OR("IFG", "HbA1C", "IGT")